Clinical trial inclusion criterion:
Clinically stable and on stable triple therapy with an ICS/LABA and tiotropium;

Annotated entities:
- Procedure: "stable triple therapy"
- Condition: "Clinically stable"
- Drug: "ICS/LABA"
- Drug: "tiotropium"